Clinical trial exclusion criterion:
Subject unwilling to accept a blood transfusion

Annotated entities:
- Non-query-able: "Subject unwilling to accept a blood transfusion"
- Post-eligibility: "Subject unwilling to accept a blood transfusion"